Able to give informed consent

The above is a clinical trial inclusion criterion. Annotated with entity spans:
[Post-eligibility: Able to give informed consent]